在代謝性酸中毒（metabolic acidosis）時，呼吸系統 可能發生下列何種變化？
A. 呼吸頻率增加（enhanced respiratory frequency）
B. 呼吸終止症候群（apnea syndrome）
C. 陳施氏呼吸（Cheyne-Stokes respiration）
D. 逆向式呼吸（paradoxical respiration）

正確答案：A. 呼吸頻率增加（enhanced respiratory frequency）